Clinical trial exclusion criterion:
Current abnormal blood panel (assessed by comprehensive metabolic panel, lipid panel and complete blood count).

Annotated entities:
- Temporal: "Current"
- Value: "abnormal"
- Procedure: "blood panel"
- Procedure: "metabolic panel"
- Procedure: "lipid panel"
- Procedure: "complete blood count"